一位 18 歲的女性，主訴頻尿、尿急和恥骨上方疼痛，脹尿時疼痛加劇，但尿完後疼痛感暫時緩解。過去 6 個月曾做過多次尿液細菌培養為陰性反應，服用抗生素無法改善症狀，麻醉下的膀胱鏡檢查可發現脹尿後有出血點。她最有可能的診斷是：
A. 急性膀胱炎（acute cystitis）
B. 間質性膀胱炎（interstitial cystitis）
C. 不明原因的膀胱疼痛症候群（painful bladder syndrome of unknown etiology）
D. 膀胱過動症（overactive bladder）

正確答案：C. 不明原因的膀胱疼痛症候群（painful bladder syndrome of unknown etiology）